Known hypersensitivity to tetracycline, doxycycline or azithromycin

The above is a clinical trial exclusion criterion. Annotated with entity spans:
Known [Condition: hypersensitivity] to [Drug: tetracycline], [Drug: doxycycline] or [Drug: azithromycin]